Clinical trial exclusion criterion:
Chronic cardiovascular/pulmonary disease

Entity relations:
- Has_temporal("cardiovascular disease", "Chronic")
- OR("cardiovascular disease", "pulmonary disease")